Clinical trial exclusion criterion:
Creatinine clearance (estimated by Cockcroft-Gault) <30 ml / min.

Entity relations:
- Has_qualifier("Creatinine clearance", "Cockcroft-Gault")
- Has_value("Creatinine clearance", "<30 ml / min")